Clinical trial inclusion criterion:
Body Mass Index (BMI) between 18 <= BMI <= 27 kilogram per meter square (kg/m^2)

Annotated entities:
- Measurement: "Body Mass Index (BMI)"
- Value: "between 18 <= BMI <= 27 kilogram per meter square (kg/m^2)"